Clinical trial exclusion criterion:
Any condition other than coronary artery disease with a life expectancy <12 months

Annotated entities:
- Condition: "coronary artery disease"
- Negation: "other than"
- Condition: "condition"
- Observation: "life expectancy"
- Value: "<12 months"